一名 18 歲女性因愛美而實行快速減肥計畫，她嚴格限制澱粉和肉類的攝取量，只吃水果和蔬菜，結果她每日的鉀攝取量由 65 mmol/day 遽增到 130 mmol/day。如果以目前的方式實施減肥計畫，你認為三週後她身體內最可能發生的變化為何？
A. 血中的鉀離子濃度會大幅度上升（>1 mmol/L）
B. 鈉離子的排出速率（Sodium excretion rate）會大幅度上升
C. 血漿中的 Aldosterone 濃度會上升
D. 腎臟近端腎小管的鉀排出量會大量增加

正確答案：C. 血漿中的 Aldosterone 濃度會上升